Clinical trial exclusion criterion:
Can not cooperate with the treatment

Entity relations:
- Has_negation("cooperate with the treatment", "not")